patients with concomitant use of IUDs.

The above is a clinical trial exclusion criterion. Annotated with entity spans:
patients with concomitant use of [Drug: IUDs].